An initial plasma sodium concentration of lower than 130 mmol/L

The above is a clinical trial exclusion criterion. Annotated with entity spans:
An [Multiplier: initial] [Measurement: plasma sodium concentration] of [Value: lower than 130 mmol/L]